Patient must have been on a commercially approved anticoagulation therapy for at least two (2) months prior to randomization in the OAT Study.

The above is a clinical trial inclusion criterion. Annotated with entity spans:
Patient must have been on a commercially approved [Drug: anticoagulation therapy] for [Temporal: at least two (2) months prior to randomization] in the OAT Study.